Clinical trial exclusion criterion:
Active peptic ulceration or gastrointestinal bleeding.

Annotated entities:
- Temporal: "Active"
- Condition: "peptic ulceration"
- Condition: "gastrointestinal bleeding"